smoking at least 10 cigarettes per day

The above is a clinical trial inclusion criterion. Annotated with entity spans:
[Observation: smoking] [Multiplier: at least 10 cigarettes per day]